一位兩歲男孩被帶至門診，媽媽陳述小男孩四天前與其它小朋友嬉戲時，突然有短暫發紺情形但隨即又恢復，這四天來常有陣發性咳嗽及喘鳴，但並無其他鼻塞、流鼻涕等感冒症狀，肺部X光檢查結果正常，下列 那一處置是必須優先考慮的？
A. 不需治療，觀察即可
B. 點滴輸液
C. 支氣管鏡檢查
D. 給予抗生素

正確答案：C. 支氣管鏡檢查